Clinical trial exclusion criterion:
Patient is suffering with unstable angina in last one week.

Entity relations:
- Has_temporal("unstable angina", "last one week")